Clinical trial inclusion criterion:
2. Screening tool: Wechsler Abbreviated Scale of Intelligence.

Annotated entities:
- Parsing_Error: "2."
- Procedure: "Wechsler Abbreviated Scale of Intelligence"